Significant alcohol withdrawal (CIWA>8) at screening, after confirming a blood alcohol level of zero.

The above is a clinical trial exclusion criterion. Annotated with entity spans:
[Qualifier: Significant] [Condition: alcohol withdrawal] ([Measurement: CIWA][Value: >8]) [Temporal: at screening], after confirming a [Measurement: blood alcohol level] of [Value: zero].